Clinical trial exclusion criteria:
Patients requiring surgery for neoplastic processes
Allergy to acetaminophen
Liver dysfunction and elevated Liver Function Tests (LFTs)
Alcohol or drug dependency
Mental retardation
Less than 50 kg of weight
regnant women
Patients requiring long-acting opioid pain management (including fentanyl patch, oxycontin, etc) for over 3 weeks immediately prior to surgery

Annotated entities:
- Procedure: "surgery"
- Condition: "neoplastic processes"
- Drug: "acetaminophen"
- Condition: "Allergy"
- Condition: "Liver dysfunction"
- Value: "elevated"
- Measurement: "Liver Function Tests"
- Measurement: "LFTs"
- Condition: "drug dependency"
- Condition: "Alcohol dependency"
- Condition: "Mental retardation"
- Value: "Less than 50 kg"
- Measurement: "weight"
- Condition: "regnant"
- Person: "women"
- Drug: "long-acting opioid"
- Mood: "requiring"
- Drug: "fentanyl patch"
- Drug: "oxycontin"
- Multiplier: "for over 3 weeks"
- Temporal: "immediately prior to surgery"